Clinical trial exclusion criterion:
Known to be sero-positive for human immunodeficiency virus (HIV), hepatitis C virus (HCV), or hepatitis B virus (HBV)

Entity relations:
- Has_value("human immunodeficiency virus (HIV)", "sero-positive")
- multi("sero-positive for human immunodeficiency virus (HIV)", "human immunodeficiency virus (HIV)")
- Has_value("hepatitis C virus (HCV)", "sero-positive")
- Has_value("hepatitis B virus (HBV)", "sero-positive")
- multi("sero-positive for hepatitis C virus (HCV)", "hepatitis C virus (HCV)")
- multi("sero-positive for hepatitis B virus (HBV)", "hepatitis B virus (HBV)")
- OR("sero-positive for human immunodeficiency virus (HIV)", "sero-positive for hepatitis C virus (HCV)", "sero-positive for hepatitis B virus (HBV)")